停經後婦女之熱潮紅（hot flush）較可能的原因為何？
A. estrogen 減少，FSH 增加
B. estrogen 減少，FSH 減少
C. estrogen 減少，LH 增加
D. estrogen 減少，LH 減少

正確答案：C. estrogen 減少，LH 增加